Which protein mediates the replacement of H2A by H2A.Z in the yeast Saccharomyces cerevisiae?

The multisubunit nucleosome-remodeling enzyme complex SWR1, conserved from yeast to mammals, catalyzes the ATP-dependent replacement of histone H2A in canonical nucleosomes with H2A.Z.